Cirrhosis, chronic active hepatitis or chronic persistent hepatitis

The above is a clinical trial exclusion criterion. Annotated with entity spans:
[Condition: Cirrhosis], [Condition: chronic active hepatitis] or [Condition: chronic persistent hepatitis]